Según la Teoría del Desarrollo Cognitivo de Piaget, un niño de 5 años de edad se encuentra en:
1. Periodo de operaciones formales.
2. Periodo sensorio-motor.
3. Periodo de operaciones concretas.
4. Periodo preoperacional.

Respuesta correcta: 4. Periodo preoperacional.